Unable to continue participation for 156 weeks

The above is a clinical trial exclusion criterion. Annotated with entity spans:
[Post-eligibility: Unable to continue participation for 156 weeks]